26 歲懷孕 18 週病患，上腹痛、嘔吐、食慾不佳、口乾舌燥約 3 天，此次懷孕為第一胎，之前定期產檢皆為正常；耳溫 37.8℃，血壓 100/60 mmHg，脈搏 130/min，呼吸 30/min，肺音正常，上腹部有輕微壓痛但無反彈痛，全身皮膚乾燥，下列那一項診斷最有可能？
A. 糖尿病性酮酸血症
B. 妊娠劇吐症（Hyperemesis gravidarum）
C. 急性腸炎併脫水
D. 急性骨盆腔發炎

正確答案：A. 糖尿病性酮酸血症